國際勃起功能指數（international index of erectile function, IIEF），是一項廣泛使用的自我評估問卷調查，包括各項性功能區塊（domain），除了：
A. 勃起功能
B. 性伴侶滿意度
C. 性慾
D. 高潮功能

正確答案：B. 性伴侶滿意度